Clinical trial inclusion criterion:
Patients must have measurable disease. If prior radiation therapy was administered, measurable disease must be outside the radiation field.

Entity relations:
- Has_qualifier("measurable disease", "outside the radiation field")
- Has_qualifier("radiation therapy", "measurable disease")